Clinical trial inclusion criterion:
Primary B-NHL, PTCL (ALK+ anaplastic large cell lymphoma and NK(natural killer cell )/T cell lymphoma were excluded) or HL patients confirmed by histopathology;

Annotated entities:
- Condition: "Primary B-NHL"
- Condition: "PTCL"
- Condition: "ALK+ anaplastic large cell lymphoma and NK(natural killer cell )/T cell lymphoma"
- Negation: "excluded"
- Condition: "HL"